當一側輸尿管完全阻塞時會產生代償現象之敘述，下列何者錯誤？
A. 急性期時該側腎血流增加
B. 急性期時該側腎小球過濾率上升
C. Felsen 2003年的研究給予實驗動物L-arginine可以增加腎血流與輸尿管壓力
D. 當阻塞解除時，可能會有多尿現象

正確答案：B. 急性期時該側腎小球過濾率上升